Clinical trial exclusion criterion:
Pregnancy or breast-feeding

Annotated entities:
- Condition: "Pregnancy"
- Observation: "breast-feeding"